Clinical trial exclusion criterion:
Patients with uninvestigated macroscopic hematuria

Entity relations:
- Has_qualifier("macroscopic hematuria", "uninvestigated")